關於先天性氣管食道瘻管（congenital tracheoesophageal fistula），下列何者錯誤？
A. 可分為五型，其中最常見者為"H"狀氣管食道瘻管
B. X光影像檢查可區別有無食道閉鎖
C. 閉鎖之食道，可經由插入之胃管打轉證實
D. 病患常合併有吸入性肺炎，或其他骨骼、消化道等先天異常

正確答案：A. 可分為五型，其中最常見者為"H"狀氣管食道瘻管